Clinical trial inclusion criterion:
2. Females of child-bearing potential (FOCP) must have a negative serum beta human chorionic gonadotropin (HCG) pregnancy test.

Annotated entities:
- Person: "Females"
- Condition: "child-bearing potential"
- Measurement: "serum beta human chorionic gonadotropin (HCG) pregnancy test"
- Value: "negative"